Clinical trial inclusion criterion:
only occlusal and/or occlusal-proximal surfaces with caries lesions with dentin involvement

Entity relations:
- Has_qualifier("caries lesions", "occlusal surfaces")
- AND("caries lesions", "dentin involvement")
- OR("occlusal surfaces", "occlusal-proximal surfaces")